Clinical trial exclusion criterion:
HBsAg negative at baseline

Annotated entities:
- Condition: "HBsAg negative"
- Temporal: "at baseline"